Poor personal hygiene

The above is a clinical trial exclusion criterion. Annotated with entity spans:
[Condition: Poor personal hygiene]